Clinical trial exclusion criterion:
Indication for emergent cesarean or known fetal anomaly

Entity relations:
- AND("Indication", "emergent cesarean")
- OR("Indication", "fetal anomaly")